Describe DeepTRIAGE

Accurately differentiating between breast cancer sub-types is an important part of clinical decision-making. DeepTRIAGE uses an attention mechanism to obtain personalised biomarker scores that describe how important each gene is in predicting the cancer sub-type for each sample.